Clinical trial inclusion criterion:
Able to read and write in English

Annotated entities:
- Observation: "Able to read and write in English"